Untreated pituitary insufficiency.

The above is a clinical trial exclusion criterion. Annotated with entity spans:
[Qualifier: Untreated] [Condition: pituitary insufficiency].